Clinical trial exclusion criterion:
12. Patients with active connective tissue disease

Annotated entities:
- Parsing_Error: "12."
- Condition: "connective tissue disease"
- Temporal: "active"